一位 60 歲病患因腹部劇痛、輕度癱瘓被送來急診，尿液檢查呈酒紅色，基因分析發現：參與血紅素 （heme）合成的酵素發生錯義突變（missense mutation）。下列何者是最可能的診斷？
A. 苯酮尿症（phenylketonuria）
B. 楓糖漿尿症（maple syrup urine disease）
C. 黑尿症（alkaptonuria）
D. 紫質症（porphyria）

正確答案：D. 紫質症（porphyria）